Clinical trial exclusion criterion:
Breast-feeding women or fertile women not agreeing to use an effective method of contraception

Entity relations:
- Has_negation("agreeing to use an effective method of contraception", "not")
- AND("women", "Breast-feeding")
- AND("women", "fertile")
- Has_context("women", "agreeing to use an effective method of contraception")
- OR("women", "women")